Clinical trial exclusion criterion:
Subjects with excessively thin corneas.

Annotated entities:
- Condition: "excessively thin corneas"